下列敘述那些正確？①陰莖骨折（penile fracture）多發生在陰莖懸韌帶（suspensory ligament）遠側 ②陰莖骨折如果採取保守治療會有10%以上發生勃起時陰莖彎曲（penile curvature） ③陰莖穿透傷（penetrating injury）要考慮做逆行性尿道攝影（retrograde urethrography） ④急診發現車禍受傷男性的尿道口有出血時，必須馬上放置導尿管治療
A. ①②③
B. ①②④
C. ①③④
D. ②③④

正確答案：A. ①②③